Clinical trial inclusion criterion:
Known or suspected gram-positive infection.

Annotated entities:
- Qualifier: "gram-positive"
- Condition: "infection"